Clinical trial exclusion criterion:
Active infection, e.g., deep-tissue infection, that the Investigator considers sufficiently serious to preclude study participation

Entity relations:
- Has_qualifier("infection", "Active")
- Subsumes("infection", "deep-tissue infection")